下列何者不是臨床上作基因治療的必要條件？
A. 目前無合適治療法的疾病
B. 疾病的突變基因之確定
C. 疾病的突變基因與疾病具關聯性
D. In vitro 的偵測系統即足夠評估其療效（efficacy）

正確答案：D. In vitro 的偵測系統即足夠評估其療效（efficacy）